Undergoing elective primary, resurfacing arthroplasty, revision, or second stage re-implantation total hip replacement;

The above is a clinical trial inclusion criterion. Annotated with entity spans:
Undergoing [Qualifier: elective] [Qualifier: primary], [Qualifier: resurfacing arthroplasty], [Qualifier: revision], or [Qualifier: second stage re-implantation] [Procedure: total hip replacement];